Exclusion criteria are pregnancy, patients with contraindications to regional anesthesia, allergy to LAs, patients taking opioids regularly due to chronic pain, use of anticoagulation drugs other than acetylsalicylic acid or dipyridamole, atrioventricular block, diabetes.

The above is a clinical trial exclusion criterion. Annotated with entity spans:
Exclusion criteria are [Condition: pregnancy], patients with [Condition: contraindications] to [Procedure: regional anesthesia], [Condition: allergy] to [Drug: LAs], patients taking [Drug: opioids] [Multiplier: regularly] due to [Condition: chronic pain], use of [Drug: anticoagulation drugs] [Negation: other than] [Drug: acetylsalicylic acid] or [Drug: dipyridamole], [Condition: atrioventricular block], [Condition: diabetes].